¿Qué trastorno del sueño con inicio en la infancia y adolescencia presenta menor incidencia familiar?
1. Síndrome de Kleine-Levin.
2. Narcolepsia.
3. Trastorno del ritmo circadiano, tipo sueño retrasado.
4. Terrores nocturnos.
5. Sonambulismo.

Respuesta correcta: 1. Síndrome de Kleine-Levin.